Clinical trial exclusion criterion:
Subjects with exclusion criteria required by local law (e.g. age, breastfeeding)

Annotated entities:
- Post-eligibility: "Subjects with exclusion criteria required by local law (e.g. age, breastfeeding)"